Patients receiving prednisone = 1mg/kg/d for the treatment of acute GVHD or mild, severe chronic GVHD.

The above is a clinical trial exclusion criterion. Annotated with entity spans:
Patients receiving [Drug: prednisone] [Value: = 1mg/kg/d] for the treatment of [Condition: acute GVHD] or [Qualifier: mild], [Qualifier: severe] [Qualifier: chronic] [Condition: GVHD].